引起急性感染性腹瀉，大便呈水狀且顯微鏡檢查看不到白血球，其最可能的致病菌是：
A. Vibrio cholerae
B. Salmonella species
C. Shigella species
D. Entamoeba histolytica

正確答案：A. Vibrio cholerae